Clinical trial exclusion criterion:
Active fungal infection or pulmonary infiltrates (prior treated disease stable for 2 weeks is allowable)

Entity relations:
- Has_qualifier("prior treated disease", "stable")
- Has_temporal("stable", "for 2 weeks")
- Has_negation("prior treated disease", "is allowable")
- AND("fungal infection", "prior treated disease")
- OR("fungal infection", "pulmonary infiltrates")